Which class of disorders are caused by AMPA receptor GluA2 subunit defects?

AMPA receptor GluA2 subunit defects are a cause of neurodevelopmental disorders.